none, all patients meeting the inclusion criteria will be eligible.

The above is a clinical trial exclusion criterion. Annotated with entity spans:
[Non-representable: none, all patients meeting the inclusion criteria will be eligible.]